下列有關短小包膜絛蟲（Hymenolepis nana）感染人體的敘述，何者錯誤？①吞食蟲卵為唯一的感染途徑 ②主要感染小孩 ③輕度感染即會引起腹痛及腹瀉 ④有可能引起過度感染 （hyperinfection）
A. ②④
B. ①③
C. ①②
D. ③④

正確答案：B. ①③